Clinical trial exclusion criterion:
Recurrent varicose veins

Annotated entities:
- Condition: "varicose veins"
- Multiplier: "Recurrent"